What 3 organs are the sphincter of Oddi associated with?

Sphincter of Oddi is associated with the pancreatic duct, duodenum and gallbladder.